Clinical trial exclusion criteria:
Patient with contraindication to misoprostol or vasopressin, personal history or cardiac or pulmonary disease, history of prior myomectomy

Annotated entities:
- Drug: "misoprostol"
- Drug: "vasopressin"
- Condition: "contraindication"
- Temporal: "personal history"
- Condition: "disease cardiac"
- Condition: "pulmonary disease"
- Temporal: "history"
- Temporal: "prior"
- Procedure: "myomectomy"